Brain death

The above is a clinical trial inclusion criterion. Annotated with entity spans:
[Condition: Brain death]